Clinical trial exclusion criterion:
Cancer within the last 5 years except prostate cancer and surgically removed basal or squamous cell carcinoma of the skin

Entity relations:
- Has_temporal("Cancer", "last 5 years")
- AND("basal cell carcinoma of the skin", "surgically")
- Has_negation("prostate cancer", "except")
- OR("basal cell carcinoma of the skin", "squamous cell carcinoma of the skin")
- OR("prostate cancer", "basal cell carcinoma of the skin")